Clinical trial exclusion criterion:
Anteriorly located tumor

Annotated entities:
- Qualifier: "Anteriorly located"
- Condition: "tumor"